Clinical trial exclusion criterion:
pregnancy, breast feeding

Entity relations:
- OR("pregnancy", "breast feeding")